Clinical trial exclusion criterion:
Inability to walk;

Annotated entities:
- Condition: "Inability to walk"